Patients who are on anticoagulation medication that may not be safely held for the procedure (≥ 5 days for antiplatelet agents and warfarin; ≥ 24 hours for low-molecular weight heparin formulations) will be excluded.

The above is a clinical trial exclusion criterion. Annotated with entity spans:
Patients who are on [Drug: anticoagulation medication] that [Qualifier: may not be safely held for the procedure] ([Multiplier: ≥ 5 days] for [Drug: antiplatelet agents] and [Drug: warfarin]; [Multiplier: ≥ 24 hours] for [Drug: low-molecular weight heparin] formulations) will be excluded.